Mild Cognitive Impairment (MCI);

The above is a clinical trial exclusion criterion. Annotated with entity spans:
[Condition: Mild Cognitive Impairment] ([Condition: MCI]);